有關腎絲球內之環間細胞（mesangial cells），下列敘述何者錯誤？
A. 胚胎發育上，此細胞源於單核吞噬系統（mononuclear phagocytotic system）之先驅細胞
B. 當腎絲球受傷時，此細胞可以分泌白血球間質-1（interleukin-1）
C. 此細胞具有吞噬能力（phagocytosis）以去除腎絲球過濾後之殘渣物
D. 此細胞可以提供足細胞（podocyte）結構上的支持

正確答案：A. 胚胎發育上，此細胞源於單核吞噬系統（mononuclear phagocytotic system）之先驅細胞